Premorbid IQ of over 70

The above is a clinical trial inclusion criterion. Annotated with entity spans:
[Measurement: Premorbid IQ] of [Value: over 70]